renal insufficiency (calculated glomerular filtration rate under 60 ml/min/1.73 m2 according to Cockcroft-Gault scale )

The above is a clinical trial exclusion criterion. Annotated with entity spans:
[Condition: renal insufficiency] ([Measurement: calculated glomerular filtration rate] [Value: under 60 ml/min/1.73 m2] according to [Qualifier: Cockcroft-Gault scale] )